Clinical trial exclusion criterion:
Patients with kyphoplasty cement or hardware that would preclude effective catheter placement.

Annotated entities:
- Device: "kyphoplasty cement"
- Device: "kyphoplasty hardware"
- Qualifier: "preclude effective catheter placement"